一位 45 歲男性，7 年前發現有淋巴瘤，經過治療達到緩解後一直未復發，也無其他異常。最近一次抽 血檢查的結果如下：血紅素 12.1 g/dL，紅血球數 5.41×106/mm3，MCV 69.5 fL，白血球數 4,640/mm3，分類正常，血小板數 174,000/mm3；血鐵質（ferritin）277 ng/mL，血紅素電泳分析顯示HbA2 2.1% （正常＜3.5%），HbF 1.1%（正常＜2.0%）。這位男士最可能是有下列何種疾病？
A. α-Thalassemia
B. β-Thalassemia
C. anemia of chronic disease
D. Sideroblastic anemia

正確答案：A. α-Thalassemia